關於手術性子宮腔鏡與子宮擴張液（distention media）的選擇，下列敘述何者正確？
A. 若使用單極電刀，則子宮擴張液應使用含離子之液體，如乳酸林格氏液（lactated Ringer's solution）
B. 若使用雙極電刀，則子宮擴張液應使用不含離子之液體，如山梨糖醇（sorbital）
C. 單極電刀在子宮擴張液中能產生電燒的效果是來自於電流的功率密度（power density）
D. 若使用雙極電刀，則子宮擴張液不可使用生理食鹽水

正確答案：C. 單極電刀在子宮擴張液中能產生電燒的效果是來自於電流的功率密度（power density）